A previous history of intolerance to the study drug or related compounds and additives

The above is a clinical trial exclusion criterion. Annotated with entity spans:
A [Temporal: previous history] of [Condition: intolerance] to the [Drug: study drug] or [Drug: related compounds] and additives